Clinical trial exclusion criterion:
Diarrhea, grade 1 or greater by the National Cancer Institute Common Terminology Criteria for Adverse Events (NCI-CTCAE, version [v] 4.0)

Annotated entities:
- Condition: "Diarrhea"
- Measurement: "National Cancer Institute Common Terminology Criteria for Adverse Events"
- Value: "grade 1 or greater"
- Measurement: "NCI-CTCAE, version [v] 4.0"